一般認為 Alzheimer's disease 主要是因何種神經傳導物質（neurotransmitter）減少所致？
A. dopamine
B. serotonin
C. acetylcholine
D. norepinephrine

正確答案：C. acetylcholine